What is the "flight-or-fight response"?

This is also known as " flight-or- fight response" and is defined as an individual's response to a stimulus such as stress, that includes loss of sleep, anxiety, shortness of breath, muscle and joint pain.